Dentro de las principales fases de la extrusión y esferonización tenemos:
1. Mezclado en seco, amasado húmedo y compactación.
2. Amasado húmedo, compactación y secado.
3. Mezclado en húmedo, compactación , y secado.
4. Amasado húmedo, secado y tamizado.
5. Amasado en seco, secado y tamizado.

Respuesta correcta: 4. Amasado húmedo, secado y tamizado.